Clinical trial inclusion criterion:
Surgery intent within 4 weeks

Annotated entities:
- Procedure: "Surgery"
- Mood: "intent"
- Temporal: "within 4 weeks"